Clinical trial exclusion criterion:
Subjects with serum calcium levels equal to or greater than 10.2 mg / dl.

Annotated entities:
- Measurement: "serum calcium levels"
- Value: "equal to or greater than 10.2 mg / dl"